Clinical trial exclusion criterion:
Major organ transplantation.

Annotated entities:
- Procedure: "Major organ transplantation"